Brain tumor and other neoplastic disorders outside the brain where disease itself or its treatment (radiation, chemotherapy) is likely to affect brain structure or function.

The above is a clinical trial exclusion criterion. Annotated with entity spans:
[Condition: Brain tumor] and other [Condition: neoplastic disorders] [Qualifier: outside the brain] where disease itself or its treatment ([Procedure: radiation], [Procedure: chemotherapy]) is [Qualifier: likely to affect brain structure] or function.